La especie radicalaria de oxígeno más reactiva y, por tanto, más peligrosa es:
1. Anión superóxido.
2. Peróxido de hidrógeno.
3. Ión superóxido.
4. Radical hidroxilo.
5. Depende del tejido.

Respuesta correcta: 4. Radical hidroxilo.